Genotype 1 and 4 infection.

The above is a clinical trial inclusion criterion. Annotated with entity spans:
[Measurement: Genotype] [Value: 1 and 4] [Condition: infection].